Clinical trial exclusion criterion:
10. Pregnant women or women with reproductive potential who are sexually active and not using an acceptable form of contraception.

Entity relations:
- Has_qualifier("contraception", "acceptable form of")
- Has_negation("contraception", "not")
- OR("Pregnant", "women")
- OR("women", "women")